Clinical trial inclusion criterion:
Periodontal parameters : Depth Probing (PS), Visible Plaque Index (IPV), Gingival Index (GI) and Probing Bleed Index (SS). The normal included were: PS = 1 to 3 mm, GI = 0, IPV = score 0 e SS = score 0.

Annotated entities:
- Measurement: "Depth Probing (PS)"
- Measurement: "Visible Plaque Index (IPV)"
- Measurement: "Gingival Index (GI)"
- Measurement: "Probing Bleed Index (SS)"
- Measurement: "PS"
- Value: "= 1 to 3 mm"
- Value: "= 0"
- Value: "score 0"
- Value: "score 0"
- Measurement: "SS"
- Measurement: "IPV"
- Measurement: "GI"